下列有關Q熱感染（Q fever）的病因與表現的敘述，何者正確？
A. 在臺灣的個案以境外移入為主
B. 皮膚發現紅疹可以做為感染Q熱診斷依據
C. 在原有瓣膜疾病問題的病患，可能導致心內膜炎（endocarditis）
D. 是急性感染症，不會造成慢性感染

正確答案：C. 在原有瓣膜疾病問題的病患，可能導致心內膜炎（endocarditis）